Una mujer de 45 años acude a la consulta remitida desde Cirugía con el diagnóstico de un tumor neuroendocrino diagnosticado tras pancreatectomía parcial por un tumor de 2 cms en cola del páncreas. El tumor había sido detectado de forma casual en una TAC abdominal solicitada para completar el estudio de un quiste simple hepático. Interrogando a la paciente destacan como antecedentes reglas irregulares, estando en amenorrea desde hace 6 meses, y cólicos renoureterales de repetición desde los 20 años de edad por los que ha precisado litotricia en varias ocasiones. Además presenta antecedentes familiares de cólicos renoureterales. ¿Cuál es su sospecha diagnóstica?
1. Una neoplasia endocrina múltiple tipo 1 o Síndrome de Wermer.
2. Una neoplasia endocrina múltiple tipo 2 A o Síndrome de Sipple.
3. Una neoplasia endocrina múltiple tipo 2B.
4. Somatostatinoma.
5. Un tumor neuroendocrino productor de PTH.

Respuesta correcta: 1. Una neoplasia endocrina múltiple tipo 1 o Síndrome de Wermer.